Clinical trial exclusion criterion:
Subject has a known contraindication to MRE or IC.

Entity relations:
- AND("contraindication", "MRE")
- OR("MRE", "IC")